Clinical trial inclusion criterion:
BMI < 40 kg/m2

Annotated entities:
- Measurement: "BMI"
- Value: "< 40 kg/m2"